Clinical trial exclusion criterion:
Current use of systemic steroids >20 mg QD prednisone (or equivalent)

Annotated entities:
- Drug: "systemic steroids"
- Multiplier: ">20 mg QD"
- Drug: "prednisone"